Meet the clinical (Amsel) criteria for BV

The above is a clinical trial inclusion criterion. Annotated with entity spans:
Meet the clinical ([Qualifier: Amsel]) [Qualifier: criteria] for [Condition: BV]